Clinical trial exclusion criterion:
Treated currently with golimumab or certolizumab

Annotated entities:
- Drug: "golimumab"
- Drug: "certolizumab"